Known pregnancy

The above is a clinical trial exclusion criterion. Annotated with entity spans:
Known [Condition: pregnancy]